glatiramer acetate,

The above is a clinical trial inclusion criterion. Annotated with entity spans:
[Drug: glatiramer acetate],